Clinical trial exclusion criteria:
Abnormal resting ECG
Current abnormal blood panel (assessed by comprehensive metabolic panel, lipid panel and complete blood count).
Hypertension (currently taking anti-hypertensive medications or resting blood pressure >140/90 mmHg)
Medical history of cardiovascular disease, malignant cancer, diabetes or kidney disease
Obesity (Body Mass Index > 30)
Current pregnancy
Unable to provide consent

Annotated entities:
- Value: "Abnormal"
- Procedure: "resting ECG"
- Temporal: "Current"
- Value: "abnormal"
- Procedure: "blood panel"
- Procedure: "metabolic panel"
- Procedure: "lipid panel"
- Procedure: "complete blood count"
- Condition: "Hypertension"
- Drug: "anti-hypertensive medications"
- Measurement: "resting blood pressure"
- Value: ">140/90 mmHg"
- Condition: "cardiovascular disease"
- Condition: "malignant cancer"
- Condition: "diabetes"
- Condition: "kidney disease"
- Condition: "Obesity"
- Measurement: "Body Mass Index"
- Value: "> 30"
- Condition: "pregnancy"
- Temporal: "Current"
- Informed_consent: "Unable to provide consent"